Clinical trial exclusion criterion:
Pregnancy or Lactation

Annotated entities:
- Condition: "Pregnancy"
- Condition: "Lactation"